Clinical trial inclusion criteria:
Children aged 0-59 months living with families registered in the rural Bandim Health Project Health and Demographic Surveillance Site are included, provided a parent/guardian consent.

Annotated entities:
- Person: "Children"
- Person: "aged"
- Value: "0-59 months"
- Observation: "living with families registered in the rural Bandim Health Project Health"
- Visit: "Person Surveillance Site"